32 歲王小姐有憂鬱病史，於吞食約 50 c.c.「通樂」清潔劑後一小時，被家人送到急診室，血壓為 110/70 mmHg，呼吸 22 次/分，心跳 90 次/分，體溫 37℃，下列何種處置最適當？
A. 插鼻胃管抽取清潔劑
B. 插鼻胃管灌洗消化道
C. 吞食大量牛奶
D. 給予靜脈輸液，進行理學檢查

正確答案：D. 給予靜脈輸液，進行理學檢查